Children that the nurse evaluates to die within the next 24 hours.

The above is a clinical trial inclusion criterion. Annotated with entity spans:
[Non-query-able: Children that the nurse evaluates to die within the next 24 hours.]